下列何者沒有傳導腳趾感覺？
A. 腓淺神經（superficial fibular nerve）
B. 隱神經（saphenous nerve）
C. 足底內神經（medial plantar nerve）
D. 腓深神經（deep fibular nerve）

正確答案：B. 隱神經（saphenous nerve）